Cases complaining of hematemesis.

The above is a clinical trial exclusion criterion. Annotated with entity spans:
Cases complaining of [Condition: hematemesis].